Clinical trial exclusion criterion:
9. Chronic infection related to tuberculosis or fungal or mycobacterial disease.

Annotated entities:
- Parsing_Error: "9."
- Condition: "tuberculosis"
- Condition: "fungal disease"
- Condition: "mycobacterial disease"
- Multiplier: "Chronic"
- Condition: "infection"
- Observation: "related to"